Clinical trial inclusion criteria:
Men 18 years or older
ONB within 1 year post-surgery.

Annotated entities:
- Person: "Men"
- Value: "18 years or older"
- Person: "18 years or older"
- Condition: "ONB"
- Temporal: "within 1 year post-surgery"
- Procedure: "surgery"
- Reference_point: "surgery"